腦中風半側偏癱的患者，其患側肢的手部可以做出掌面抓握（palmar prehension）的動作，依照布朗氏分期（Brunnstrom's stage）來判定，應該屬於第幾期？
A. Stage II
B. Stage III
C. Satge IV
D. Stage V

正確答案：D. Stage V